Paciente de 60 años que acude a urgencias del hospital por cuadro de dolor torácico izquierdo, con    tos    y    expectoración    amarillenta, temperatura de 38.7ºC, sensación de falta de aire. Saturación arterial de 02 80%. Hemograma leucocitos 12000/uL con 86 % de polimorfonucleares. Rx de tórax: infiltrado alveolar en base izquierda con broncograma aéreo. Ante la sospecha de neumonía, se hace Ag de neumococo en orina que es positivo y se envía cultivo de esputo al servicio de Microbiología. ¿Qué tratamiento antibiótico empírico de los indicados es más correcto en espera de resultados microbiológicos?
1. Ceftazidima.
2. Claritromicina.
3. Azitromicina
4. Ceftriaxona.
5. Doxiciclina.

Respuesta correcta: 4. Ceftriaxona.